Clinical trial exclusion criterion:
2. First-degree family history of any neurological disorder with a potentially hereditary basis, including migraines, epilepsy, or multiple sclerosis.

Annotated entities:
- Parsing_Error: "2."
- Qualifier: "First-degree"
- Observation: "family history of"
- Condition: "neurological disorder"
- Qualifier: "potentially hereditary basis"
- Condition: "migraines"
- Condition: "epilepsy"
- Condition: "multiple sclerosis"